Medication which affect glycemic control

The above is a clinical trial exclusion criterion. Annotated with entity spans:
[Drug: Medication] which [Observation: affect glycemic control]